International normalized ratio (INR) > 1.5 ×ULN

The above is a clinical trial inclusion criterion. Annotated with entity spans:
[Measurement: International normalized ratio (INR)] [Value: > 1.5 ×ULN]